Clinical trial exclusion criterion:
The participant has unstable systemic disease.

Entity relations:
- Has_qualifier("systemic disease", "unstable")